Clinical trial exclusion criterion:
The patients are undergoing current administration of anti-cancer therapies, or are attending other clinical trials.

Annotated entities:
- Procedure: "anti-cancer therapies"
- Observation: "attending other clinical trials"